Clinical trial exclusion criterion:
Active cancer

Annotated entities:
- Condition: "cancer"
- Qualifier: "Active"